一位 1 歲病童，有長期分泌型腹瀉（secretory diarrhea），腹部超音波發現有腫塊，此時需特別考慮何種疾病的可能性？
A. 腎上腺出血（adrenal hemorrhage）
B. 腎上腺皮質癌（adrenocortical carcinoma）
C. 神經母細胞瘤（neuroblastoma）
D. 威爾姆氏腫瘤（Wilms tumor）

正確答案：C. 神經母細胞瘤（neuroblastoma）